Clinical trial inclusion criterion:
Musculoskeletal etiology of low back. Patients with non-musculoskeletal etiologies such as urinary tract infection, ovarian cysts, or influenza like illness will be excluded. The primary clinical diagnosis, at the conclusion of the ED visit, must be a diagnosis consistent with non-traumatic, non-radicular, musculoskeletal LBP.

Annotated entities:
- Condition: "urinary tract infection"
- Condition: "etiology"
- Negation: "non"
- Condition: "etiologies"
- Qualifier: "low back"
- Condition: "ovarian cysts"
- Condition: "influenza like illness"
- Negation: "excluded"
- Condition: "LBP"
- Qualifier: "non-radicular"
- Qualifier: "non-traumatic"
- Qualifier: "musculoskeletal"
- Qualifier: "musculoskeletal"
- Qualifier: "Musculoskeletal"